下列有關手部掌骨（metacarpal）骨折之敘述，何者錯誤？
A. 掌骨骨折約占手部（hand）及手腕骨折的 1/3
B. 掌骨骨折最常見的症狀是腫脹及疼痛
C. 假如病人是因人類或動物咬傷而造成骨折，手術時要加以沖洗並給予強效抗生素
D. 掌骨骨折最常見的地方是在掌骨頭（metacarpal head）的部分

正確答案：D. 掌骨骨折最常見的地方是在掌骨頭（metacarpal head）的部分